Clinical trial inclusion criterion:
Eligible for percutaneous coronary intervention with Absorb Bioresorbable Vascular Scaffold or Everolimus Eluting Stent

Annotated entities:
- Mood: "Eligible for"
- Procedure: "percutaneous coronary intervention"
- Device: "Absorb Bioresorbable Vascular Scaffold"
- Device: "Everolimus Eluting Stent"